Chronic renal failure (GFR < 30 ml/min)

The above is a clinical trial exclusion criterion. Annotated with entity spans:
[Multiplier: Chronic] [Condition: renal failure] ([Measurement: GFR] [Value: < 30 ml/min])